Patients may have received 1-3 prior systemic therapies in the metastatic setting.

The above is a clinical trial inclusion criterion. Annotated with entity spans:
Patients may have received [Multiplier: 1-3] [Temporal: prior] [Procedure: systemic therapies] in the [Qualifier: metastatic setting].